Las glándulas del colon son:
1. Tubulares simples.
2. Tubulares compuestas.
3. Tuboloacinares.
4. Acinares.

Respuesta correcta: 1. Tubulares simples.